allergy to Paclitaxel

The above is a clinical trial exclusion criterion. Annotated with entity spans:
[Condition: allergy] to [Drug: Paclitaxel]